所謂透明黴菌（hyaline molds）是指一群在病灶組織中，呈現下列那種共同性質的真菌？
A. 產生有分隔之菌絲
B. 產生無分枝之菌絲
C. 與青黴菌屬（Penicillium）之形態相似
D. 產生具色素之菌絲

正確答案：A. 產生有分隔之菌絲